Clinical trial exclusion criteria:
Unstable patient
Joint contracture
Spasticity
Loss of function is expected to be improved by reliable tendon transfer, tenodesis or arthrodesis that is available
Evidence of recovering finger/thumb extension at 4-6 months
Greater than 12 months from spinal cord injury
Subject not fluent in English or an appropriate translator not available

Annotated entities:
- Person: "patient"
- Qualifier: "Unstable"
- Condition: "Joint contracture"
- Condition: "Spasticity"
- Observation: "Loss of function"
- Mood: "improved by"
- Procedure: "tendon transfer"
- Procedure: "tenodesis"
- Procedure: "arthrodesis"
- Observation: "recovering extension"
- Qualifier: "finger"
- Qualifier: "thumb"
- Temporal: "at 4-6 months"
- Condition: "spinal cord injury"
- Temporal: "Greater than 12 months"
- Post-eligibility: "Subject not fluent in English or an appropriate translator not available"